Clinical trial exclusion criterion:
Metastatic breast cancer.

Annotated entities:
- Condition: "breast cancer"
- Qualifier: "Metastatic"